45歲男性胰臟腺癌末期患者，數度發生下肢短暫性靜脈血栓（evanescent phlebothrombosis），病人如同時發生腦梗塞，其最可能的心臟併發症為何？
A. 非細菌性血栓性心內膜炎（non-bacterial thrombotic endocarditis）
B. Libman-Sacks氏心內膜炎（Libman-Sacks endocarditis）
C. 急性感染性心內膜炎（acute infective endocarditis）
D. 急性心肌梗塞（acute myocardial infarction）

正確答案：A. 非細菌性血栓性心內膜炎（non-bacterial thrombotic endocarditis）